Patient with an esophageal location of scleroderma

The above is a clinical trial exclusion criterion. Annotated with entity spans:
Patient with an [Qualifier: esophageal location] of [Condition: scleroderma]